人體內製造性荷爾蒙之原料為何？
A. Triglyceride
B. Cholesterol
C. Collagen
D. Glycoprotein

正確答案：B. Cholesterol